Ante una niña de 7 meses de edad que acude a urgencias con un cuadro sugerente de bronquiolitis, ¿cuál sería el agente etiológico más probable?
1. Adenovirus.
2. Virus parainfluenza 1.
3. Virus de la gripe B.
4. Bocavirus.
5. Virus respiratorio sincitial.

Respuesta correcta: 5. Virus respiratorio sincitial.